Acute or chronic clinically significant gastrointestinal disease

The above is a clinical trial exclusion criterion. Annotated with entity spans:
[Qualifier: Acute] or [Qualifier: chronic] [Qualifier: clinically significant] [Condition: gastrointestinal disease]